Able to walk and complete lower-limb tests with both legs

The above is a clinical trial inclusion criterion. Annotated with entity spans:
[Condition: Able to walk] and complete lower-limb tests [Qualifier: with both legs]